Serum potassium level = 5.5 mEq/L

The above is a clinical trial exclusion criterion. Annotated with entity spans:
[Measurement: Serum potassium level] [Value: = 5.5 mEq/L]